Subjects with serious acute or chronic disease involved liver, kidney, and brain or have to use potent CYP3A4-inhibitor or nitrate to treat the underlying diseases.

The above is a clinical trial exclusion criterion. Annotated with entity spans:
Subjects with [Qualifier: serious] [Temporal: acute] or [Condition: chronic disease involved liver], kidney, and brain or have to use [Qualifier: potent] [Drug: CYP3A4-inhibitor] or [Drug: nitrate] to treat the [Condition: underlying diseases].